Clinical trial exclusion criterion:
extensive lysis of adhesions

Entity relations:
- Has_qualifier("lysis of adhesions", "extensive")